Person who has a score on 10m walk test less than 3km/h (~0.8m/s) (based on 10m walk test conducted during recruiting).

The above is a clinical trial exclusion criterion. Annotated with entity spans:
Person who has a score on [Measurement: 10m walk test] [Value: less than 3km/h] (~[Value: 0.8m/s)] (based on 10m walk test conducted during recruiting).